La memoria episódica es:
1. No declarativa o implícita, que guarda habilidades, hábitos o rutinas de la vida diaria. Su adquisición depende de la cantidad de tiempo empleado en practicarlos y el tipo de adiestramiento utilizado.
2. Declarativa o explícita, de experiencias personales basada en el recuerdo de sucesos concretos localizables en el tiempo y en un lugar específico.
3. Semántica a largo plazo.
4. La que permite retener conceptos, conocimientos y acontecimientos.
5. La que se utiliza a corto plazo, por ejemplo, para recordar la estrofa de una canción repitiéndola varias veces durante unos minutos.

Respuesta correcta: 2. Declarativa o explícita, de experiencias personales basada en el recuerdo de sucesos concretos localizables en el tiempo y en un lugar específico.